Clinical trial exclusion criterion:
liver dysfunction with a factor of at least 3 above the upper limit of normal in AST and ALT levels

Entity relations:
- AND("liver dysfunction", "AST levels")
- Has_value("AST levels", "factor of at least 3 above the upper limit of normal")
- AND("liver dysfunction", "ALT levels")
- Has_value("ALT levels", "factor of at least 3 above the upper limit of normal")